Psychological, social, familial, or geographical reasons that would prevent regular follow-up

The above is a clinical trial exclusion criterion. Annotated with entity spans:
[Non-query-able: Psychological, social, familial, or geographical reasons that would prevent regular follow-up]